乳癌手術執行前哨淋巴結摘取術（sentinel node biopsy）的最重要目的為何？
A. 預防乳癌再發
B. 減少因全腋下淋巴結廓清術引起之併發症
C. 美觀
D. 乳房無法全切除手術才做

正確答案：B. 減少因全腋下淋巴結廓清術引起之併發症